obesity - BMI (body mass index) >30 kg/m2

The above is a clinical trial exclusion criterion. Annotated with entity spans:
[Condition: obesity] - [Measurement: BMI] ([Measurement: body mass index]) [Value: >30 kg/m2]